Clinical trial inclusion criterion:
Pain duration <2 weeks (336 hours). Patients with more than two weeks of pain are at increased risk of poor pain and functional outcomes.(9)

Annotated entities:
- Condition: "Pain"
- Temporal: "duration <2 weeks"
- Temporal: "duration 336 hours"